王女士是一位慢性精神分裂症殘餘型（residual type）患者，目前在精神科日間病房接受規則藥物治療與精神復健，該患者較不可能出現下列那種臨床表徵？
A. 缺乏社交動機
B. 少話
C. 淡漠情緒
D. 激躁和攻擊行為

正確答案：D. 激躁和攻擊行為